Hombre de 19 años de edad que consulta por un cuadro de 24 horas de evolución de dolor, tumefacción e impotencia funcional de la rodilla derecha acompañado de fiebre de 38ºC. La exploración física pone de manifiesto signos inflamatorios y derrame articular en la rodilla derecha. Los datos analíticos muestran una leucocitosis con neutrofilia y una elevación de la proteina C reactiva. Se hace el diagnóstico sindrómico de monoartritis aguda. ¿Cuál es el diagnóstico etiológico más probable?
1. Artritis por microcristales.
2. Artritis reactiva.
3. Artritis infecciosa bacteriana.
4. Artritis infecciosa por mycobacterias.
5. Artritis reumatoide.

Respuesta correcta: 3. Artritis infecciosa bacteriana.